Clinical trial exclusion criterion:
Individuals who are pregnant or actively breastfeeding

Entity relations:
- Has_temporal("breastfeeding", "actively")
- OR("pregnant", "breastfeeding")